Clinical trial exclusion criterion:
Contraindication to neuraxial anesthesia

Annotated entities:
- Condition: "Contraindication"
- Procedure: "neuraxial anesthesia"